愛滋病毒感染和器官移植後，長期接受免疫抑制劑治療的病人會增加下列何種腦腫瘤的罹患率？
A. 原發性中樞神經淋巴瘤（primary CNS lymphoma）
B. 腦膜瘤（meningioma）
C. 室管膜瘤（ependymoma）
D. 顱咽管瘤（craniopharyngioma）

正確答案：A. 原發性中樞神經淋巴瘤（primary CNS lymphoma）